Clinical trial inclusion criterion:
On chronic hemodialysis not yet on the transplant list and followed in the University's hemodialysis center or in the University's nephrology clinic

Annotated entities:
- Procedure: "hemodialysis"
- Qualifier: "chronic"
- Non-query-able: "not yet on the transplant list and followed in the University's hemodialysis center or in the University's nephrology clinic"